In which yeast chromosome does the rDNA cluster reside?

Chromosome XII context is important for rDNA function in yeast